關於多毛症（hirsutism）治療之敘述，下列何者錯誤？
A. 使用medroxyprogesterone acetate治療
B. 使用flutamide治療
C. 使用spironolactone治療
D. 使用cyproterone acetate治療

正確答案：A. 使用medroxyprogesterone acetate治療